Clinical trial exclusion criterion:
Person who walks on average less than 1km per day.

Annotated entities:
- Observation: "walks"
- Multiplier: "ess than 1km per day"